Para cuál de los pasos siguientes de la síntesis de proteínas se necesita GTP (Guanosina triosfato):
1. Activación de los aminoácidos por las aminioacil-ARNt sintetasas.
2. Unión de los ribosomas al retículo endoplásmico.
3. Translocalizacion del complejo naciente ARNt-proteína desde el lugar A al lugar P.
4. Unión de los ARNm.
5. Unión de la proteína de reconocimiento de la señal a los ribosomas.

Respuesta correcta: 3. Translocalizacion del complejo naciente ARNt-proteína desde el lugar A al lugar P.